嚴重的眼瞼下垂（ptosis）應採取下列那一種手術方式比較適合？
A. 筋膜懸吊（fascial sling）
B. 提瞼肌切除（levator resection）
C. 提瞼肌懸吊（levator plication）
D. 提瞼肌前移（levator advancement）

正確答案：A. 筋膜懸吊（fascial sling）